Evidence of diastolic dysfunction showing E/E' > 10

The above is a clinical trial inclusion criterion. Annotated with entity spans:
Evidence of [Condition: diastolic dysfunction] showing [Measurement: E/E'] [Value: > 10]